肺癌中的那一類型最有可能出現副腫瘤症候群（paraneoplastic syndrome），產生腎上腺皮質促素（ACTH）？
A. 腺癌
B. 鱗狀細胞癌
C. 小細胞癌
D. 惡性間皮瘤

正確答案：C. 小細胞癌